助行器（ambulation aids）是常見的裝具，有關助行器的敘述下列何者錯誤？
A. 使用助行器的目的包括改善使用者平衡能力，重新分配下肢承重區域，以及減少下肢的疼痛
B. 助行器只可提供力量的支撐，無法提供感覺的回饋
C. 要選擇使用那一種助行器，決定於使用者所需要的平衡能力和承重協助
D. 可以把助行器當成上肢的延伸

正確答案：B. 助行器只可提供力量的支撐，無法提供感覺的回饋